Clinical trial exclusion criteria:
known hypersensitivity or contraindication to the study drugs
reversible aetiology for agitation (e.g. hypotension, hypoxia, hypoglycaemia)
known pregnancy
acute alcohol withdrawal
patients aged>75 years.

Annotated entities:
- Condition: "hypersensitivity"
- Condition: "contraindication"
- Drug: "study drugs"
- Condition: "reversible aetiology"
- Condition: "agitation"
- Condition: "hypotension"
- Condition: "hypoxia"
- Condition: "hypoglycaemia"
- Condition: "pregnancy"
- Condition: "acute alcohol withdrawal"
- Person: "aged"
- Value: ">75 years"